Chronic diathesis

The above is a clinical trial exclusion criterion. Annotated with entity spans:
[Qualifier: Chronic] [Condition: diathesis]